Sarcoma or squamous cell histology.

The above is a clinical trial exclusion criterion. Annotated with entity spans:
[Condition: Sarcoma] or [Condition: squamous cell] [Procedure: histology].